體動脈血（systemic arterial blood）中二氧化碳分壓(P coi )升高時會刺激換氣  （ventilation），最主要係透過下列何種機制？
A. 二氧化碳穿透血腦障壁進入延髓後，直接刺激中樞化學感受器（central chemoreceptor）
B. 二氧化碳穿透血腦障壁進入延髓後，形成碳酸再產生氫離子，氫離子刺激中樞化學感受器
C. 二氧化碳在體動脈血中形成碳酸再產生氫離子，氫離子穿透血腦障壁進入延髓後，刺激中樞化學感受器（central chemoreceptor）
D. 二氧化碳在體動脈血中形成碳酸再產生氫離子，氫離子刺激周邊化學感受器（peripheral chemoreceptor）

正確答案：B. 二氧化碳穿透血腦障壁進入延髓後，形成碳酸再產生氫離子，氫離子刺激中樞化學感受器